Clinical trial inclusion criterion:
Formal H.pylori treatment more than two times

Entity relations:
- Has_multiplier("H.pylori treatment", "more than two times")